Clinical trial exclusion criterion:
Patients with underlying disease cases without the possibility of resuscitation (e.g., terminal cancer);

Annotated entities:
- Condition: "terminal cancer"
- Condition: "underlying disease"
- Qualifier: "without the possibility of resuscitation"